Brain temperature > 38.5°C for more than 30 minutes

The above is a clinical trial inclusion criterion. Annotated with entity spans:
[Measurement: Brain temperature] [Value: > 38.5°C] [Temporal: for more than 30 minutes]